What are the most common side effects of amantadine ER?

The most common side effects of amantadine ER are hallucination, dizziness, orthostatic hypotension and pedal edema.